小孩的偏頭痛（Migraine）最常見種類為何？
A. 無預兆之偏頭痛
B. 有預兆之偏頭痛
C. 半身麻痺型偏頭痛
D. 眼肌麻痺型偏頭痛

正確答案：A. 無預兆之偏頭痛